Clinical trial inclusion criterion:
Diagnosis of sleep disordered breathing or obstructive sleep apnea

Annotated entities:
- Condition: "sleep disordered breathing"
- Condition: "obstructive sleep apnea"